14歲男童患有氣喘，醫師希望以吸入型類固醇（inhaled corticosteroid, ICS）來控制其病情，有關吸入型類固醇（ICS）之使用，下列何者錯誤？
A. ICS是所有類型的氣喘病人的第一線控制型用藥
B. 適當使用ICS，可減少氣喘病人的死亡率
C. ICS的使用，可能引起該病童發生聲音沙啞及咽喉黴菌感染
D. 使用吸藥輔助艙（spacer），可減少咽喉黴菌感染的發生

正確答案：A. ICS是所有類型的氣喘病人的第一線控制型用藥